No lesion should be included when more than 50% of the lesion is further down than 4 cm beneath the skin level.

The above is a clinical trial exclusion criterion. Annotated with entity spans:
No [Condition: lesion] should be included when [Multiplier: more than 50% of the lesion] is [Value: further down than 4 cm] [Measurement: beneath the skin level].